Clinical trial inclusion criteria:
Primary B-NHL, PTCL (ALK+ anaplastic large cell lymphoma and NK(natural killer cell )/T cell lymphoma were excluded) or HL patients confirmed by histopathology;
Ages =18 years old, < 80 years old;
ECOG (Eastern Cooperative Oncology Group)score: 0-2
At least one measurable lesion;
Expected survival time=3 months;
Liver function: transaminase=2.5× upper limit of normal value,bilirubin=1.5×upper limit of normal value;
Renal function: serum creatinine is 44-133 mmol/L;
Routine blood test:WBC=3.0×109/L,Neutrophils=1.5×109/L,Hb=100g/L,Platelet=80×109/L; LVEF=50%;
New York Heart Association (NYHA) heart function classification is I-II grade
signed informed consent.

Annotated entities:
- Condition: "Primary B-NHL"
- Condition: "PTCL"
- Condition: "ALK+ anaplastic large cell lymphoma and NK(natural killer cell )/T cell lymphoma"
- Negation: "excluded"
- Condition: "HL"
- Person: "Ages"
- Value: "=18 years old, < 80 years old"
- Measurement: "ECOG (Eastern Cooperative Oncology Group)score"
- Value: "0-2"
- Multiplier: "At least one"
- Condition: "lesion"
- Observation: "Expected survival time="
- Value: "3 months"
- Measurement: "transaminase"
- Value: "=2.5× upper limit of normal value"
- Measurement: "bilirubin"
- Value: "=1.5×upper limit of normal value"
- Measurement: "serum creatinine"
- Value: "44-133 mmol/L"
- Measurement: "test:WBC"
- Value: "=3.0×109/L"
- Measurement: "Neutrophils"
- Value: "=1.5×109/L"
- Measurement: "Hb"
- Value: "=100g/L"
- Measurement: "Platelet"
- Value: "=80×109/L"
- Measurement: "LVEF"
- Value: "=50%"
- Measurement: "New York Heart Association heart function classification"
- Value: "I-II grade"
- Measurement: "NYHA"
- Informed_consent: "signed informed consent"